¿Cómo se regula en el músculo la actividad de la enzima glucógeno fosforilasa?:
1. Mediante efectores alostéricos.
2. Mediante fosforilación-desfosforilación.
3. Mediante efectores alostéricos y fosforilación- desfosforilación.
4. Mediante proteólisis controlada.

Respuesta correcta: 3. Mediante efectores alostéricos y fosforilación- desfosforilación.